Clinical trial exclusion criterion:
Severe hepatocellular insufficiency (ASAT or ALAT > 5N, or bilirubin > 2N)

Entity relations:
- Has_value("bilirubin", "> 2N")
- Has_value("ALAT", "> 5N")
- Has_value("ASAT", "> 5N")
- Subsumes("hepatocellular insufficiency", "ASAT")
- OR("ASAT", "ALAT", "bilirubin")